Clinical trial exclusion criterion:
1. The subject is a pregnant or lactating female.

Annotated entities:
- Condition: "pregnant"
- Condition: "lactating"
- Person: "female"